Clinical trial inclusion criterion:
Early Syphilis Cases Determined to Be Serofast at 6 Months after Initial Treatment

Entity relations:
- Has_index("6 Months after Initial Treatment", "Initial Treatment")
- multi("Initial Treatment", "Treatment")
- Has_multiplier("Treatment", "Initial")
- Has_temporal("Serofast", "6 Months after Initial Treatment")
- Has_qualifier("Early Syphilis", "Serofast")